Clinical trial exclusion criterion:
Treated with intramuscular or intravenous corticosteroids in the last 6 months for RA activity

Entity relations:
- Has_qualifier("corticosteroids", "intramuscular")
- Has_temporal("corticosteroids", "in the last 6 months")
- OR("intramuscular", "intravenous")